Clinical trial exclusion criterion:
A diagnosis of cancer (other than superficial squamous or basal cell skin cancer) in the past 3 years or current treatment for the active cancer.

Annotated entities:
- Condition: "cancer"
- Negation: "other than"
- Condition: "superficial squamous skin cancer"
- Condition: "basal cell skin cancer"
- Temporal: "in the past 3 years"
- Procedure: "treatment"
- Condition: "cancer"
- Qualifier: "active"